闌尾（appendix）最常見的腫瘤為：
A. 黏液性腺癌（mucinous adenocarcinoma）
B. 漿液性腺癌（serous adenocarcinoma）
C. 管狀腺瘤（tubular adenoma）
D. 類癌（carcinoid tumor）

正確答案：D. 類癌（carcinoid tumor）